What is the aim of the METABRIC project?

The METABRIC [Molecular Taxonomy of Breast Cancer International Consortium] cohort aims at the integration of genomic and transcriptomic profiles of 2000 breast tumours.